Clinical trial exclusion criterion:
Known hypersensitivity to perflutren (contained in Definity)

Annotated entities:
- Condition: "hypersensitivity"
- Drug: "perflutren"
- Drug: "Definity"